Clinical trial exclusion criterion:
Borderline or Antisocial Personality Disorder.

Entity relations:
- OR("Borderline Personality Disorder", "Antisocial Personality Disorder")